Significant GI disease, previous major gastric/bowel surgery, difficulty swallowing or malabsorption syndrome.

The above is a clinical trial exclusion criterion. Annotated with entity spans:
[Qualifier: Significant] [Condition: GI disease], previous [Qualifier: major] [Procedure: gastric]/[Procedure: bowel surgery], [Condition: difficulty swallowing] or [Condition: malabsorption syndrome].